Clinical trial inclusion criterion:
4. Expectation of survival for at least 2 months.

Entity relations:
- Has_temporal("survival", "for at least 2 months")
- Has_context("survival", "Expectation")